Clinical trial inclusion criterion:
Clinical Dementia Rating (CDR) test inferior or equal to 1

Annotated entities:
- Measurement: "Clinical Dementia Rating (CDR) test"
- Value: "inferior or equal to 1"